La especificidad clínica de un parámetro (test) analítico, con respecto a una determinada patología, se define como:
1. La media de concentraciones de dicho test en pacientes sanos.
2. Una concentración patológica del test en presencia de la enfermedad.
3. Una concentración patológica del test en ausencia de la enfermedad.
4. Una concentración normal del test en ausencia de la enfermedad.
5. Una concentración normal del test en presencia de la enfermedad.

Respuesta correcta: 4. Una concentración normal del test en ausencia de la enfermedad.